Pregnant, lactating, or planning to become pregnant during the course of the trial;

The above is a clinical trial exclusion criterion. Annotated with entity spans:
[Condition: Pregnant], [Condition: lactating], or [Mood: planning to become] [Condition: pregnant] [Temporal: during the course of the trial];